Visual loss and/or serous detachment on OCT < 6 weeks;

The above is a clinical trial exclusion criterion. Annotated with entity spans:
[Condition: Visual loss] and/or [Condition: serous detachment] on [Procedure: OCT] [Temporal: < 6 weeks];